Dos compuestos A y B forman una dispersión sólida, siendo la temperatura de ebullición de A puro inferior a la del compuesto B puro. Indique cuál de los siguientes enunciados es correcto:
1. Por debajo de la temperatura eutéctica el sistema está formado por micro cristales de A disueltos en B líquido.
2. Por debajo de la temperatura eutéctica el sistema está formado por micro cristales de B disueltos en A líquido.
3. Por debajo de la temperatura eutéctica el sistema estará formado por una mezcla de A y B, ambos en estado sólido.
4. Al enfriar una disolución de B en A, en la que A es el disolvente, aparecerán cristales de B.

Respuesta correcta: 3. Por debajo de la temperatura eutéctica el sistema estará formado por una mezcla de A y B, ambos en estado sólido.